俗稱的片山熱（Katayama fever）是由何種寄生蟲感染引起的？
A. 橫川吸蟲（Metagonimus yokogawai）
B. 日本血吸蟲（Schistosoma japonicum）
C. 中華肝吸蟲（Clonorchis sinensis）
D. 衛氏肺吸蟲（Paragonimus westermani）

正確答案：B. 日本血吸蟲（Schistosoma japonicum）